65歲的女性，早上因椎管狹窄症接受腰椎手術。在恢復室時，雙側下肢的運動和感覺神經功能正常。當天晚上約十一點時，主訴下背開刀處脹痛及下肢酸麻無力。檢查發現開刀處有滲血，術後傷口引流管總量只有50 毫升。雙側足部背屈及趾背屈力量為0分。有關病情之敘述，下列何者正確？
A. 先繼續觀察一天，若症狀仍無改善時，再安排進一步脊髓造影（myelography）檢查
B. 應懷疑可能是在手術進行中神經已受到損傷而造成下肢無力，應解釋並告知病患及家屬
C. 應懷疑發生術後脊髓硬膜上血腫（hematoma），造成神經受壓迫而導致下肢無力，應	速安排手術清除血
D. 應懷疑發生術後急性傷口感染，產生脊髓硬膜上膿瘍，造成神經受壓迫下肢無力，應	速安排手術清創

正確答案：C. 應懷疑發生術後脊髓硬膜上血腫（hematoma），造成神經受壓迫而導致下肢無力，應	速安排手術清除血